El martes después de cenar un niño de ocho años pide permiso para jugar con la videoconsola, pero los padres se niegan porque es tarde y debe acostarse para ir al colegio al día siguiente. El niño empieza a dar la murga hasta conseguir que los padres cedan. Según el planteamiento teórico del proceso de coacción familiar de Patterson, ¿qué le sucede a la conducta de ceder de los padres?
1. Se castiga positivamente.
2. Se castiga negativamente.
3. Se extingue.
4. Se refuerza positivamente.
5. Se refuerza negativamente.

Respuesta correcta: 5. Se refuerza negativamente.